Contraindication to sitagliptin or metformin or thiazolidinedione

The above is a clinical trial exclusion criterion. Annotated with entity spans:
[Condition: Contraindication] to [Drug: sitagliptin] or [Drug: metformin] or [Drug: thiazolidinedione]